Monoamine oxidase inhibitors (MAOi)

The above is a clinical trial exclusion criterion. Annotated with entity spans:
[Drug: Monoamine oxidase inhibitors (MAOi)]